住院病人發生急性腎衰竭時，下列何者不是誘因？
A. 最近曾接受顯影劑注射
B. 最近曾使用抗生素
C. 最近曾發生低血壓
D. 最近曾服用降血脂藥物

正確答案：D. 最近曾服用降血脂藥物